Diagnosis of comorbid DSM-IV major depressive episode will be allowed in the study provided that the diagnosis is secondary to OCD, they have a baseline Montgomery Depression Rating Scale (MADRS) score of less than or equal to 19, and the onset of OCD predates the onset of the current episode of depression by five or more years.

The above is a clinical trial inclusion criterion. Annotated with entity spans:
Diagnosis of [Qualifier: comorbid] [Qualifier: DSM-IV] [Condition: major depressive episode] will be allowed in the study provided that the diagnosis is secondary to [Condition: OCD], they have a [Qualifier: baseline] [Measurement: Montgomery Depression Rating Scale] ([Measurement: MADRS]) [Value: score of less than or equal to 19], and the [Condition: onset of OCD] [Temporal: predates the onset of the current episode of depression by five or more years].